28 歲張先生開車不慎撞車，造成左下肢脛骨骨折在醫院接受石膏固定，回家後左下肢疼痛難忍而且感覺異常，他又回到急診處就醫，下列那一種治療最先要執行？
A. 開刀固定手術
B. 筋膜切開術
C. 切開石膏
D. 冰敷止痛消腫

正確答案：C. 切開石膏